Age < 45 or > 55 years.

The above is a clinical trial exclusion criterion. Annotated with entity spans:
[Person: Age] [Value: < 45 or > 55 years].